Subjects with high gastrointestinal bleeding risk, including the following conditions: local active ulcer lesions with positive fecal occult blood test (++); history of black stool, or vomiting blood in the past 3 months;unresected primary lesion in stomach with positive fecal occult blood test (+), ulcerated gastric carcinoma with massive alimentary tract bleeding risk judged by PIs based on gastric endoscopy result;

The above is a clinical trial exclusion criterion. Annotated with entity spans:
Subjects with [Qualifier: high] [Observation: gastrointestinal bleeding risk], including the following conditions: local [Qualifier: active] [Condition: ulcer lesions] with [Value: positive] [Measurement: fecal occult blood test] ([Value: ++]); history of [Condition: black stool], or [Condition: vomiting blood] in the [Temporal: past 3 months];unresected [Condition: primary lesion] in [Qualifier: stomach] with [Value: positive] [Measurement: fecal occult blood test] ([Value: +]), [Condition: ulcerated gastric carcinoma] with [Qualifier: massive] [Qualifier: alimentary tract] [Observation: bleeding risk] judged by PIs based on gastric endoscopy result;